Clinical trial exclusion criterion:
Subject has a current chemical/alcohol dependency or significant psychosocial disturbance.

Entity relations:
- Has_qualifier("psychosocial disturbance", "significant")
- OR("chemical dependency", "alcohol dependency", "psychosocial disturbance")